Form of diagnosed psoriasis other than chronic plaque psoriasis (i.e. guttate, erythrodermic, pustular)

The above is a clinical trial exclusion criterion. Annotated with entity spans:
Form of diagnosed [Condition: psoriasis] [Negation: other than] [Condition: chronic plaque psoriasis] (i.e. [Qualifier: guttate], [Qualifier: erythrodermic], [Qualifier: pustular])